Both genders;

The above is a clinical trial inclusion criterion. Annotated with entity spans:
Both [Person: genders];